下列有關各項抗生素常見不良藥物反應之敘述，何項最不適當？
A. clindamycin-腹瀉
B. gentamicin-腎毒性
C. linezolid-皮疹
D. vancomycin-紅人症候群（red man syndrome）

正確答案：C. linezolid-皮疹